Radical neck dissection 須犠牲那一條肌肉？
A. mylohyoid muscle
B. omohyoid muscle
C. sterno-cleido-mastoid muscle
D. digastric muscle

正確答案：C. sterno-cleido-mastoid muscle